Clinical trial exclusion criterion:
diagnosis of schizophrenia or presence of thought disorder symptoms

Annotated entities:
- Condition: "schizophrenia"
- Condition: "thought disorder"
- Mood: "symptoms"